Clinical trial exclusion criterion:
Pregnancy, breast-feeding

Annotated entities:
- Pregnancy_considerations: "Pregnancy, breast-feeding"